Age over 18 years,

The above is a clinical trial inclusion criterion. Annotated with entity spans:
[Person: Age] [Value: over 18 years],